4. Patients with CRPS must have met current IASP (International Association for the Study of Pain) diagnostic criteria

The above is a clinical trial inclusion criterion. Annotated with entity spans:
4. Patients with [Condition: CRPS] must have [Value: met] current [Measurement: IASP (International Association for the Study of Pain) diagnostic criteria]